Clinical trial exclusion criterion:
Past history of systemic steroid use over 2 weeks within the last 2 years

Annotated entities:
- Temporal: "Past history"
- Drug: "systemic steroid"
- Temporal: "over 2 weeks"
- Temporal: "within the last 2 years"